Clinical trial inclusion criterion:
Able to complete precision grips with both hands

Annotated entities:
- Procedure: "complete precision grips with both hands"
- Mood: "Able to"